Clinical trial exclusion criterion:
Electronic or magnetic implants, such as pacemakers

Annotated entities:
- Device: "magnetic implants"
- Device: "Electronic implants"
- Device: "pacemakers"